Affiliate to social security or beneficiary of such a regime

The above is a clinical trial inclusion criterion. Annotated with entity spans:
[Person: Affiliate to social security] or beneficiary of such a regime